Metabolic alkalosis

The above is a clinical trial inclusion criterion. Annotated with entity spans:
[Condition: Metabolic alkalosis]